Which syndrome is caused by pathogenic COL4A3-COL4A5 variants?

Pathogenic variants in the genes in Alport Syndrome (COL4A3-C4A5) are found in as many as 30% of individuals with focal and segmental glomerulosclerosis (FSGS), and 20% with familial immunoglobulin A (IGA) Glomerulonephritis. The population frequencies for Alport syndrome are suggested to be higher than the frequencies of predicted pathogenic variants, but must be adjusted for the disease penetrance individual variants and for the likelihood of already diagnosed disease and non-Gly substitutions.